Clinical trial inclusion criterion:
Creatinine < 2 × upper normal limits.

Annotated entities:
- Measurement: "Creatinine"
- Value: "< 2 × upper normal limits"